Clinical trial exclusion criterion:
1. Patient or relatives unable or unwilling to give informed consent

Annotated entities:
- Parsing_Error: "1."
- Non-query-able: "Patient or relatives unable or unwilling to give informed consent"
- Post-eligibility: "Patient or relatives unable or unwilling to give informed consent"